Sobre la intervención en la creencias subyacentes (o asunciones básicas o actitudes disfuncionales) de los pacientes con depresión, señale la OPCIÓN FALSA:
1. Forman parte esencial del tratamientos cognitivo para la depresión propuesto por Aaron Beck.
2. Para intervenir sobre dichas creencias es necesario indagar sobre ellas con técnicas como la flecha descendiente o diálogo socrático.
3. La teoría propuesta por Beck plantea que si no se tratan dichas creencias subyacentes, esas estructuras cognitivas permanecerán latentes favoreciendo posteriores recaídas.
4. La terapia propuesta por Beck plantea que, para modificar dichas creencias, es crucial que el terapeuta enumere todas las razones que invalidan dichas creencias.
5. La interacción debe basarse en el principio de “empirismo colaborador”.

Respuesta correcta: 4. La terapia propuesta por Beck plantea que, para modificar dichas creencias, es crucial que el terapeuta enumere todas las razones que invalidan dichas creencias.